Clinical trial exclusion criterion:
Having plan to be pregnant;

Entity relations:
- Has_mood("pregnant", "plan")